Which disease is treated with Risdiplam?

Risdiplam is approved for spinal muscular atrophy.